Clinical trial exclusion criterion:
Subjects with topographic evidence of keratoconus.

Entity relations:
- AND("topographic evidence", "keratoconus")